Clinical trial exclusion criterion:
Diagnosed or suspected malignant tumor;

Entity relations:
- Has_mood("malignant tumor", "Diagnosed")
- OR("Diagnosed", "suspected")